Para identificar proteínas en muestras clínicas, una técnica analítica especialmente adecuada es:
1. ICP-MS (Espectrometría de emisión en Plasma      de     Inducción      AcopladoEspectrometría de Masas).
2. Espectrometría de Masas MALDI-TOF (desorción/ionización mediante láser asistida por matriz acoplada a un analizador de tiempo de vuelo).
3. Absorción Atómica con Horno de Grafito.
4. Biosensor electroquímico.

Respuesta correcta: 2. Espectrometría de Masas MALDI-TOF (desorción/ionización mediante láser asistida por matriz acoplada a un analizador de tiempo de vuelo).